Babies who have been close to death

The above is a clinical trial exclusion criterion. Annotated with entity spans:
[Person: Babies] who [Temporal: have been] [Observation: close to death]